Unable to give informed consent or follow the protocol

The above is a clinical trial exclusion criterion. Annotated with entity spans:
[Non-query-able: Unable to give informed consent or follow the protocol]